Previous diabetic history, coronary artery disease

The above is a clinical trial exclusion criterion. Annotated with entity spans:
[Temporal: Previous] [Condition: diabetic] [Temporal: history], [Condition: coronary artery disease]